Clinical trial inclusion criterion:
signed informed consent

Annotated entities:
- Informed_consent: "signed informed consent"